Clinical trial exclusion criterion:
Systemic sclerosis patients:

Annotated entities:
- Condition: "Systemic sclerosis"